運動起始瞬間會發生氧缺現象（oxygen deficit），最初10秒肌肉收縮能源主要來自：
A. 游離脂肪酸（free fatty acid）
B. 磷酸肌酸（phosphocreatine）
C. 肝醣（glycogen）
D. 乳酸（lactate）

正確答案：B. 磷酸肌酸（phosphocreatine）